下列何者是續發性高血壓（secondary hypertension）最常見的原因？
A. renal parenchymal disease
B. primary aldosteronism
C. pheochromocytoma
D. Cushing's syndrome

正確答案：A. renal parenchymal disease